下列有關背景型糖尿病視網膜病變（background diabetic retinopathy; BDR）的敘述，何者錯誤？
A. 視網膜病變局限於視網膜內（intraretinal）
B. 微血管瘤（microaneurysms）是其早期視網膜病變之特徵
C. 黃色視網膜滲出物（hard exudates）亦是其視網膜病變之特徵
D. 需要積極視網膜雷射治療（laser photocoagulation）以防止惡化

正確答案：D. 需要積極視網膜雷射治療（laser photocoagulation）以防止惡化